Clinical trial exclusion criterion:
Subjects with known hypersensitivity to tranexamic acid

Entity relations:
- AND("hypersensitivity", "tranexamic acid")